Clinical trial exclusion criterion:
Previous myocardial infarction, coronary artery intervention, coronary artery bypass surgery, or other cardiac surgery

Entity relations:
- Has_temporal("myocardial infarction", "Previous")
- OR("myocardial infarction", "coronary artery bypass surgery", "other cardiac surgery", "coronary artery intervention")